一位急診室病人出現黃疸（jaundice）、發燒、發寒及肝腫大現象。這位病人在一年前接種過 B 型肝炎病毒（HBV）疫苗，未接種A 型肝炎病毒（HAV）疫苗；經血液學檢查結果如下：HAV IgM-negative， HAV IgG-positive；HBsAg-negative，HBsAb-positive，HBcAb-negative；HCV Ab-positive。則下列何 者可能正確？
A. 現在感染 HAV，未感染過 HBV，過去曾感染 C 型肝炎病毒（HCV）
B. 現在感染 HAV，過去曾感染 HBV 及 HCV
C. 現在感染 HBV，過去曾感染 HAV 及 HCV
D. 現在感染 HCV，過去曾感染 HAV，未感染過 HBV

正確答案：D. 現在感染 HCV，過去曾感染 HAV，未感染過 HBV